En relación a la dermatitis del pañal, indique la respuesta correcta:
1. Afecta preferentemente a pliegues y zonas cóncavas.
2. Es conveniente el uso profiláctico de cremas con corticoides suaves.
3. El número de cambios de pañal NO tiene repercusión en el desarrollo de la dermatitis del pañal.
4. La sobreinfección asociada más frecuente se produce por bacterias gram negativas.

Respuesta correcta: 1. Afecta preferentemente a pliegues y zonas cóncavas.